Patient is unable to take warfarin or other oral anti-coagulant medication.

The above is a clinical trial exclusion criterion. Annotated with entity spans:
Patient is [Mood: unable to take] [Drug: warfarin] or other [Drug: oral anti-coagulant medication].